Subject exclusion period in another study without direct individual benefit

The above is a clinical trial exclusion criterion. Annotated with entity spans:
[Post-eligibility: Subject exclusion period in another study without direct individual benefit]